Clinical trial exclusion criterion:
Acute coronary syndrome within 1 month

Annotated entities:
- Condition: "Acute coronary syndrome"
- Temporal: "within 1 month"